En Terapia Cognitiva las creencias que tienen que ver con actitudes, reglas y supuestos que se formulan en términos proposicionales del tipo “si…entonces” se denominan:
1. Creencias nucleares.
2. Creencias intermedias.
3. Esquemas de control.
4. Pensamientos automáticos.

Respuesta correcta: 2. Creencias intermedias.